Clinical trial exclusion criterion:
patient living without parental supervision.

Annotated entities:
- Non-representable: "patient living without parental supervision."